Evidence of active infection within 3 days of first dose of 852A

The above is a clinical trial exclusion criterion. Annotated with entity spans:
[Observation: Evidence] of [Condition: active infection] [Temporal: within 3 days of first dose] of [Drug: 852A]